Secondary hypertension, including SAS, PA, RAS, pheochromocytoma, Cushing's syndrome, aorta diseases, drug induced hypertension;

The above is a clinical trial exclusion criterion. Annotated with entity spans:
[Condition: Secondary hypertension], including [Condition: SAS], [Condition: PA], [Condition: RAS], [Condition: pheochromocytoma], [Condition: Cushing's syndrome], [Condition: aorta diseases], [Qualifier: drug induced] [Condition: hypertension];